50 歲女性，罹患子宮頸鱗狀上皮癌，臨床上看到腫瘤在子宮頸約 5-6 公分，合併右側子宮旁組織的侵犯，但未達骨盆壁。請問她的分期是：
A. stage IB1
B. stage IB2
C. stage IIB
D. stage IIIA

正確答案：C. stage IIB